naive to HCV treatment,

The above is a clinical trial inclusion criterion. Annotated with entity spans:
[Negation: naive] to [Procedure: HCV treatment],